What does Retapamulin treat?

Retapamulin is an antiviral medication used in the treatment of methicillin-resistant Staphylococcus aureus.